Clinical trial exclusion criterion:
Lifetime personal history of diagnosis of major depressive disorder according to the DSM-V (American Psychiatric Association, 2013) using the Structured Clinical Interview for DSM-V Axis I Disorders, Research Version, Non-patient Edition (SCID-5-RV for DSM-V; First et al., 2015)

Annotated entities:
- Condition: "major depressive disorder"
- Qualifier: "DSM-V"
- Procedure: "Structured Clinical Interview for DSM-V Axis I Disorders, Research Version, Non-patient Edition"